Documented liver biopsy result consistent with PBC

The above is a clinical trial inclusion criterion. Annotated with entity spans:
Documented [Procedure: liver biopsy] result consistent with [Condition: PBC]